Body weight less than 50 kg

The above is a clinical trial exclusion criterion. Annotated with entity spans:
[Measurement: Body weight] [Value: less than 50 kg]